Estimated glomerular filtration rate =20 mL/min and <60 mL/min

The above is a clinical trial inclusion criterion. Annotated with entity spans:
[Measurement: Estimated glomerular filtration rate] [Value: =20 mL/min and <60 mL/min]